下列降血壓藥物與其主要機轉配對何者正確？
A. fenoldopam-可以釋放出一氧化氮（nitric oxide）
B. hydralazine-抑制鈣離子內流入血管平滑肌細胞
C. minoxidil-其代謝物可開啟血管平滑肌鉀離子通道
D. sodium nitroprusside-可以活化dopamine D1受體

正確答案：C. minoxidil-其代謝物可開啟血管平滑肌鉀離子通道